List non-surgical treatment modalities that are included in the Stupp protocol.

Radiotherapy and chemotherapy are non-surgical treatment modalities that are included in the Stupp protocol. This protocol is widely used for treatment of glioblastoma.